insulin-dependent DM (diabetes mellitus), poorly controlled type II DM

The above is a clinical trial exclusion criterion. Annotated with entity spans:
[Condition: insulin-dependent DM] ([Condition: diabetes mellitus]), [Qualifier: poorly controlled] [Condition: type II DM]